Clinical trial exclusion criterion:
esmolol administration in the previous 30 days

Entity relations:
- Has_temporal("esmolol", "in the previous 30 days")